Severe or uncontrolled infection.

The above is a clinical trial inclusion criterion. Annotated with entity spans:
[Qualifier: Severe] or [Qualifier: uncontrolled] [Condition: infection].